History of allergy to any component of the IP

The above is a clinical trial exclusion criterion. Annotated with entity spans:
History of [Condition: allergy] to [Drug: any component of the IP]